Hombre de 30 años sin antecedentes de interés. Acude a consulta por la presencia de unas lesiones eritemato-violáceas de pequeño tamaño que a la palpación parecen sobreelevadas, en región pretibial. El estudio analítico muestra un hemograma y estudio de coagulación sin alteraciones y en la bioquímica, la creatinina y los iones se encuentran también dentro del rango de normalidad. El estudio del sedimento urinario demuestra hematuria, por la que el paciente ya había sido estudiado en otras ocasiones, sin obtener un diagnóstico definitivo. Respecto a la entidad que usted sospecha en este caso es FALSO que:
1. En el 20 al 50 % de los casos existe elevación de la concentración sérica de IgA.
2. En la biopsia renal son característicos los depósitos mesangiales de IgA.
3. Es frecuente la existencia de proteinuria en rango nefrótico.
4. Se considera una entidad benigna ya que menos de 1/3 de los pacientes evolucionan a insuficiencia renal.
5. La biopsia cutánea permite establecer el diagnóstico hasta en la mitad de los casos.

Respuesta correcta: 3. Es frecuente la existencia de proteinuria en rango nefrótico.